Clinical trial inclusion criterion:
Patient with high risk of bleeding as defined by (1) HASBLED score =3 OR (2) HASBLED = CHADS2VASC score, OR (3) recent history of severe bleeding (type 3a, 3b, 3c), particularly cerebral or gastrointestinal, OR (4) prior recurrent (>2) history of falls.

Entity relations:
- Has_qualifier("risk of bleeding", "high")
- Has_value("HASBLED score", "=3")
- Has_qualifier("severe bleeding", "type 3a, 3b, 3c")
- Has_qualifier("severe bleeding", "cerebral")
- Has_multiplier("falls", ">2")
- Has_qualifier("falls", "recurrent")
- OR("cerebral", "gastrointestinal")